下列何種器官內不具有淋巴小結（lymphatic nodules）？
A. 胸腺（thymus）
B. 脾臟（spleen）
C. 小腸（small intestine）
D. 扁桃體（tonsil）

正確答案：A. 胸腺（thymus）